Patients on neuroleptic drugs in the two months prior to study entry or cognitive behavioural therapy specific to OCD within four weeks of study entry

The above is a clinical trial exclusion criterion. Annotated with entity spans:
Patients on [Drug: neuroleptic drugs] [Temporal: in the two months prior to study entry] or [Procedure: cognitive behavioural therapy] specific to [Condition: OCD] [Temporal: within four weeks of study entry]